Clinical trial inclusion criterion:
Scheduled for closed reduction with percutaneous pinning under general anesthesia

Entity relations:
- AND("closed reduction with percutaneous pinning", "general anesthesia")
- Has_mood("closed reduction with percutaneous pinning", "Scheduled for")